王小姐 48 歲，平時生理週期規律正常，一週前在左側乳房摸到一個腫塊，因此她到外科門診希望接受進一步診療。對於王小姐的主訴首先施行的診療措施，下列敘述何者正確？
A. 進行乳房的身體診查時，首先應請病患端坐，目視兩側乳房是否為對稱、皮膚有無變化、乳頭是否凹陷等徵象。若皮膚呈紅斑（erythema）及水腫（edema）則應考慮切片檢查
B. 觸診乳房如果腫塊較硬且界線不明，移動時會牽扯到周圍鄰近的組織，就要懷疑有惡性的可能。尤其當腫塊有壓痛的症狀時，對於鑑別良性與惡性腫瘤很有助益
C. 於門診施行細針穿刺（fine-needle aspiration）檢查，可以鑑別診斷是屬於侵襲癌或原位癌，尤其針對鑑別腫塊是實質腫瘤（solid）或是囊狀腫瘤（cystic）幫助很大
D. 乳房攝影檢查的敏感性，在年輕的或乳房緻密的病人則較差，所以目前乳房超音波成為無症狀婦女篩檢乳癌的影像檢查首選

正確答案：A. 進行乳房的身體診查時，首先應請病患端坐，目視兩側乳房是否為對稱、皮膚有無變化、乳頭是否凹陷等徵象。若皮膚呈紅斑（erythema）及水腫（edema）則應考慮切片檢查